El coeficiente de correlación de Pearson indica que existe asociación estadística entre dos variables cuando:
1. Su valor es positivo.
2. Su valor está entre -1 (menos uno) y 1 (uno).
3. Su valor se aproxima a cero.
4. Su valor es igual o muy similar al tamaño muestral utilizado para su cálculo.
5. Su valor se acerca a sus valores extremos posibles, -1 (menos uno) o 1 (uno).

Respuesta correcta: 5. Su valor se acerca a sus valores extremos posibles, -1 (menos uno) o 1 (uno).